手術時，不慎切斷動眼神經（oculomotor n.）主幹，下列何種情形最不可能產生？
A. 上眼瞼下垂
B. 瞳孔放大
C. 淚液分泌減少
D. 睫狀肌（ciliary m.）麻痺

正確答案：C. 淚液分泌減少